Describe PWMScan

PWMScan is a fast web-based tool to scan server- resident genomes for matches to a user-suppressor PWM or transcription factor binding site model from a Public database.